Clinical trial inclusion criterion:
Need of lower third molar surgeries

Annotated entities:
- Procedure: "surgeries"
- Qualifier: "lower third molar"